Clinical trial inclusion criteria:
Children aged 3-16 with a parent/guardian (hereafter termed parent) reported history of allergy to a penicillin antibiotic in which the reported allergic reaction occurred at least six months prior to the current PED visit.
Only children well enough to be discharged to home at the conclusion of the PED visit are eligible.

Annotated entities:
- Person: "Children"
- Person: "aged"
- Value: "3-16"
- Condition: "allergy"
- Drug: "penicillin antibiotic"
- Temporal: "at least six months prior to the current PED visit"
- Condition: "allergic reaction"
- Condition: "well enough to be discharged to home"
- Temporal: "at the conclusion of the PED visit"
- Reference_point: "the conclusion of the PED visit"
- Visit: "PED"